La estructura organizativa funcional formada por profesionales sanitarios y no sanitarios, que tiene responsabilidad en la prestación sanitaria de forma integral, compartida y continuada en la zona básica de salud, recibe el nombre de:
1. Servicio Autonómico de Salud.
2. Sistema Nacional de Salud.
3. Centro de Salud.
4. Equipo de Atención Primaria.
5. Cartera de Servicios.

Respuesta correcta: 4. Equipo de Atención Primaria.